Clinical trial exclusion criterion:
No concurrent use of other investigational drugs or antineoplastic therapies.

Annotated entities:
- Negation: "No"
- Drug: "other investigational drugs"
- Procedure: "antineoplastic therapies"
- Undefined_semantics: "other investigational drugs"